Clinical trial exclusion criterion:
Gastric ulcer or duodenal ulcer with clinical manifestations or endoscopically identified acute ulcer without signs of scarring during previous 30 days.

Annotated entities:
- Condition: "Gastric ulcer"
- Condition: "duodenal ulcer"
- Condition: "clinical manifestations"
- Qualifier: "endoscopically identified"
- Procedure: "endoscopically"
- Condition: "acute ulcer"
- Negation: "without"
- Condition: "signs of scarring"
- Temporal: "during previous 30 days"